Clinical trial exclusion criterion:
Known hypersensitivity to bovine protein

Annotated entities:
- Condition: "hypersensitivity"
- Drug: "bovine protein"